Clinical trial inclusion criterion:
Patients with foot fracture scheduled for surgical repair in spinal anesthesia

Annotated entities:
- Condition: "foot fracture"
- Mood: "scheduled for"
- Procedure: "surgical repair"
- Procedure: "spinal anesthesia"